Clinical trial exclusion criterion:
Parkinson's disease already treated with APOMORPHINE pump or justifying the use of the pump continuously day and night

Annotated entities:
- Condition: "Parkinson's disease"
- Drug: "APOMORPHINE"
- Non-representable: "justifying the use of the pump continuously day and night"